La causa más frecuente por la que un recién nacido puede precisar reanimación en el paritorio es:
1. Prematuridad.
2. Aspiración de meconio.
3. Metabolopatías.
4. Malformaciones cardiacas.

Respuesta correcta: 1. Prematuridad.